Entre los fármacos opiáceos, ¿Cuál evitaría en un paciente con historia de predisposición a presentar convulsiones?
1. Tramadol.
2. Hidroxicodona.
3. Fentanilo.
4. Morfina.

Respuesta correcta: 1. Tramadol.